Clinical trial exclusion criterion:
3. History of serious ventricular arrhythmia (i.e., ventricular tachycardia or ventricular fibrillation) or cardiac arrhythmias requiring anti-arrhythmic medications, except for atrial fibrillation that is well controlled with anti-arrhythmic medication.

Annotated entities:
- Parsing_Error: "3."
- Condition: "ventricular arrhythmia"
- Condition: "ventricular tachycardia"
- Condition: "ventricular fibrillation"
- Qualifier: "serious"
- Temporal: "History"
- Condition: "cardiac arrhythmias"
- Drug: "anti-arrhythmic medications"
- Qualifier: "requiring anti-arrhythmic medications"
- Condition: "atrial fibrillation"
- Negation: "except"
- Qualifier: "well controlled with anti-arrhythmic medication"
- Drug: "anti-arrhythmic medication"